Clinical trial inclusion criterion:
Willing and capable of providing informed consent

Annotated entities:
- Post-eligibility: "Willing and capable of providing informed consent"